¿Con qué objetivo se emplea la técnica de tensión muscular aplicada en el tratamiento de fobia a la sangre?:
1. Como técnica de relajación.
2. Para desviar la atención del paciente del estímulo temido.
3. Para acelerar el proceso de habituación.
4. Para reducir los síntomas vasovagales.
5. Se emplea en las primeras sesiones para reducir la ansiedad anticipatoria.

Respuesta correcta: 4. Para reducir los síntomas vasovagales.